Clinical trial exclusion criterion:
Receiving nasal or facial surgery recently;

Entity relations:
- OR("nasal surgery", "facial surgery")